一歲大的男嬰有陣發性哭鬧且有持續嘔吐，則下列何疾病須優先排除？
A. 嬰兒肥厚性幽門阻塞
B. 腸套疊
C. 急性闌尾炎
D. 細菌性腸炎

正確答案：B. 腸套疊